Renal insuffuciency

The above is a clinical trial exclusion criterion. Annotated with entity spans:
[Condition: Renal insuffuciency]